Clinical trial exclusion criterion:
allergy to clostridium histolyticum

Annotated entities:
- Condition: "allergy"
- Observation: "clostridium histolyticum"